Breast feeding or pregnancy

The above is a clinical trial exclusion criterion. Annotated with entity spans:
[Observation: Breast feeding] or [Condition: pregnancy]